Body Mass Index (BMI) > 50

The above is a clinical trial exclusion criterion. Annotated with entity spans:
[Measurement: Body Mass Index (BMI)] [Value: > 50]